患有氣喘病史之高血壓患者，不宜使用下列何種藥物？
A. Diltiazem
B. Furosemide
C. Propranolol
D. Captopril

正確答案：C. Propranolol